Contraindication to oxycodone

The above is a clinical trial exclusion criterion. Annotated with entity spans:
[Condition: Contraindication] to [Drug: oxycodone]